Psychosis

The above is a clinical trial exclusion criterion. Annotated with entity spans:
[Condition: Psychosis]